Clinical trial exclusion criterion:
Patients with a history of epilepsy

Annotated entities:
- Condition: "epilepsy"